Clinical trial exclusion criterion:
Currently pregnant or breastfeeding

Entity relations:
- Has_temporal("pregnant", "Currently")
- OR("pregnant", "breastfeeding")